Clinical trial exclusion criterion:
History of diseases with influence on bone metabolism such as Paget's disease and primary hyperparathyroidism

Annotated entities:
- Temporal: "History"
- Condition: "diseases with influence on bone metabolism"
- Condition: "Paget's disease"
- Condition: "primary hyperparathyroidism"